Subjects for whom the investigator believes that their parents/guardians can and will comply with the requirements of the protocol

The above is a clinical trial inclusion criterion. Annotated with entity spans:
[Non-query-able: Subjects for whom the investigator believes that their parents/guardians can and will comply with the requirements of the protocol]